Describe MSstatsTMT

MSstatsTMT is a general statistical approach for relative protein quantification in MS- based experiments with TMT labeling.